Patients affected by malignancy;

The above is a clinical trial exclusion criterion. Annotated with entity spans:
Patients affected by [Condition: malignancy];